Clinical trial exclusion criterion:
Significant illness within the two weeks prior to dosing.

Annotated entities:
- Condition: "Significant illness"
- Temporal: "within the two weeks prior"